Clinical trial exclusion criterion:
Visible skin pathology, excessive freckles, or skin blemishes in the test area.

Annotated entities:
- Condition: "skin pathology"
- Condition: "freckles"
- Qualifier: "excessive"
- Condition: "skin blemishes"